若升主動脈瘤延伸至根部，造成所謂的 aortoannular ectasia，伐氏竇（sinus of valsalva）擴大，主動脈瓣閉鎖不全，須作 Bentall 氏手術時，下列何步驟不包括在內？
A. 主動脈瓣手術
B. 升主動脈人工血管置換至主動脈環部
C. 冠狀動脈再植入
D. 升主動脈人工血管置換至 sinotubular junction，保留伐氏竇

正確答案：D. 升主動脈人工血管置換至 sinotubular junction，保留伐氏竇